What is caused by the ectopic expression of CTCF?

Ectopic expression of CTCF results in severe cell growth inhibition at multiple points within the cell cycle.